Moderate to severe pulmonary dysfunction (GOLD II, II, IV)

The above is a clinical trial exclusion criterion. Annotated with entity spans:
[Qualifier: Moderate] to [Qualifier: severe] [Condition: pulmonary dysfunction] ([Measurement: GOLD] [Value: II, II, IV])